Clinical trial exclusion criterion:
Pregnant or breastfeeding women

Entity relations:
- OR("Pregnant", "breastfeeding")